ischemic heart disease or any abnormality on treadmill stress test

The above is a clinical trial exclusion criterion. Annotated with entity spans:
[Condition: ischemic heart disease] or any [Value: abnormality] on [Measurement: treadmill stress test]